Acute brain Severe injury

The above is a clinical trial inclusion criterion. Annotated with entity spans:
[Condition: Acute brain Severe injury]